Clinical trial inclusion criteria:
Age of 18 and over, male or female;
Patients with histologically confirmed advanced (stage IV) gastric cancer, NSCLC, breast cancer or ovarian cancer, who choose monotherapy of oral vascular targeting drug (apatinib) due to intolerability or inappropriateness of other therapies;
Presence of measurable lesions (=10mm on spiral CT scan) subject to RECIST 1.1;
Blood pressured controlled at 150/100 mHg following drug administration;
An ECOG PS score of between 0 and 1;
A life expectancy of at least 3 months;
Subjects who volunteer to participate in this study and have signed the Informed Consent Form (ICF), with good compliance with treatment and follow-up.

Annotated entities:
- Person: "Age"
- Value: "18 and over"
- Person: "male"
- Person: "female"
- Qualifier: "histologically confirmed"
- Procedure: "histologically"
- Qualifier: "advanced"
- Qualifier: "stage IV"
- Condition: "gastric cancer"
- Condition: "NSCLC"
- Condition: "breast cancer"
- Condition: "ovarian cancer"
- Procedure: "monotherapy"
- Drug: "oral vascular targeting drug"
- Drug: "apatinib"
- Non-representable: "due to intolerability or inappropriateness of other therapies"
- Condition: "measurable lesions"
- Value: "=10mm"
- Procedure: "spiral CT scan"
- Qualifier: "RECIST 1.1"
- Measurement: "Blood pressured"
- Qualifier: "controlled"
- Value: "150/100 mHg"
- Measurement: "ECOG PS"
- Value: "between 0 and 1"
- Observation: "life expectancy"
- Value: "at least 3 months"
- Informed_consent: "Subjects who volunteer to participate in this study and have signed the Informed Consent Form (ICF), with good compliance with treatment and follow-up."